Clinical trial exclusion criterion:
Patient does not meet inclusion criteria, discovered after randomization

Annotated entities:
- Post-eligibility: "Patient does not meet inclusion criteria, discovered after randomization"